Ongoing allergen immunotherapy

The above is a clinical trial exclusion criterion. Annotated with entity spans:
Ongoing [Procedure: allergen immunotherapy]